單一邊喉返神經麻痺會產生：
A. 聲音沙啞（Hoarseness）
B. 呼吸困難（Dyspnea）
C. 吞嚥困難（Dysphagia）
D. 流涎（Salivation）

正確答案：A. 聲音沙啞（Hoarseness）